Where is the yeast transpozable element Ty3 preferentially inserted?

rna polymerase iii